diagnosed as type 2 diabetes according to the criteria of the World Health Organization in 1999.

The above is a clinical trial inclusion criterion. Annotated with entity spans:
diagnosed as [Condition: type 2 diabetes] according to the [Qualifier: criteria of the World Health Organization in 1999].